Clinical trial exclusion criterion:
Rosuvastatin

Annotated entities:
- Drug: "Rosuvastatin"